有關過敏原皮膚測試的優點，不包含下列那一項？
A. 高敏感度
B. 可迅速得到結果
C. 費用低廉
D. 受試者使用藥物不影響測試結果

正確答案：D. 受試者使用藥物不影響測試結果